Clinical trial exclusion criterion:
Any other condition or circumstance which, in the opinion of the Principal Investigator, poses an unacceptable risk for participation in the study

Annotated entities:
- Subjective_judgement: "Any other condition or circumstance which, in the opinion of the Principal Investigator, poses an unacceptable risk for participation in the study"
- Context_Error: "Any other condition or circumstance which, in the opinion of the Principal Investigator, poses an unacceptable risk for participation in the study"
- Post-eligibility: "Any other condition or circumstance which, in the opinion of the Principal Investigator, poses an unacceptable risk for participation in the study"